Tamoxifen 最常應用於治療癌症（如乳癌及其他癌症），其主要機轉為抑制下列何種荷爾蒙感受體 （hormone receptor）之轉錄（transcription）能力？
A. 雄激素感受體（androgen receptor）
B. 雌激素感受體（estrogen receptor）
C. 甲狀腺激素感受體（thyroid hormone receptor）
D. 維生素 D 感受體（vitamin D receptor）

正確答案：B. 雌激素感受體（estrogen receptor）